Clinical trial inclusion criterion:
Patients undergoing surgery on shoulder, humerus, or clavicle

Annotated entities:
- Procedure: "surgery"
- Qualifier: "shoulder"
- Qualifier: "humerus"
- Qualifier: "clavicle"